下列有關肺泡蛋白沉積症（alveolar proteinosis）的敘述，何者錯誤？
A. 病理變化為肺泡內充滿表面活性蛋白（surfactant）
B. 大部分患者為後天型（acquired type）
C. 抗GM-CSF抗體為可能之病因
D. 臨床治療以手術切除病灶為主

正確答案：D. 臨床治療以手術切除病灶為主